Clinical trial exclusion criterion:
Cardiovascular disease such as arrythmia, ischaemic heart disease.

Annotated entities:
- Condition: "Cardiovascular disease"
- Condition: "arrythmia"
- Condition: "ischaemic heart disease"